66 歲男性，無過去病史，某天早上起床盥洗時發現自己無法漱口，右側眼睛無法完全閉合。神經學檢查發現病人有周邊型顏面神經麻痺（peripheral type facial palsy），下列何者較不可能發生？
A. 右側耳後痛
B. 有味覺障礙
C. 右耳音感減低
D. 右上額皺紋減少

正確答案：C. 右耳音感減低